下列有關威爾遜氏症（hepatolenticular degeneration；Wilson disease）的敘述，何者正確？
A. 病人的血中銅含量增加，但因為在肝臟及腦中沉澱，因此24小時尿中的總銅量反而減少
B. 此病屬於自體顯性遺傳的疾病
C. 在病人的角膜常出現具有診斷價值的凱斯-佛來斯環（Kayser-Fleischer ring）
D. 所有病人都是先以神經學的功能異常先出現，之後才出現肝功能的異常

正確答案：C. 在病人的角膜常出現具有診斷價值的凱斯-佛來斯環（Kayser-Fleischer ring）